Where, in the body, would the Cobb-Stainsby excision arthroplasty be performed?

The Cobb-Stainsby forefoot arthroplasty combines partial phalangectomy (Stainsby) with extensor tendon transfer